Patients with a history of allergy or hypersensitivity to tramadol.

The above is a clinical trial exclusion criterion. Annotated with entity spans:
Patients with a history of [Condition: allergy] or [Condition: hypersensitivity] to [Drug: tramadol].